Clinical trial inclusion criterion:
plans to receive care in the Community Health Center during the next year

Annotated entities:
- Mood: "plans to"
- Procedure: "receive care"
- Visit: "Community Health Center"
- Temporal: "during the next year"